not alert

The above is a clinical trial exclusion criterion. Annotated with entity spans:
[Observation: not alert]